一位75歲男性病人。最近半年右側鼻塞，偶有鼻涕，2個月前開始持續性右臉頰疼痛，近來鼻涕偶見血絲外，右上臼齒也覺鬆動及酸痛，視力也稍現模糊，偶有複視現象。最可能之診斷為何？
A. 右篩竇黏液囊腫
B. 右硬腭腫瘤
C. 右篩竇腫瘤
D. 右上頜竇腫瘤

正確答案：D. 右上頜竇腫瘤